Clinical trial exclusion criterion:
Subject with clinical evidence of renal disease with the past 6 months, defined as estimated glomerular filtration rate (GFR) outside the normal reference range.

Annotated entities:
- Condition: "renal disease"
- Temporal: "with the past 6 months"
- Measurement: "estimated glomerular filtration rate (GFR)"
- Value: "outside"
- Reference_point: "normal reference range"